women who are pregnant or breast feeding; women of childbearing potential who do not consent to apply at least to methods of contraception. This criterion does not apply to postmenopausal women

The above is a clinical trial exclusion criterion. Annotated with entity spans:
[Pregnancy_considerations: women who are pregnant or breast feeding; women of childbearing potential who do not consent to apply at least to methods of contraception. This criterion does not apply to postmenopausal women]